在下列何種情況時，水晶體的形狀會變得較為扁平？
A. contraction of ciliary muscle
B. accommodation for near vision
C. focusing on distant objects
D. firing of parasympathetic nerves

正確答案：C. focusing on distant objects